Clinical trial exclusion criterion:
History of malignant arrhythmias

Annotated entities:
- Temporal: "History"
- Condition: "malignant arrhythmias"